Clinical trial exclusion criterion:
Chronic obstructive pulmonary disease;

Annotated entities:
- Condition: "Chronic obstructive pulmonary disease"